Clinical trial exclusion criterion:
History of lung transplant.

Annotated entities:
- Procedure: "lung transplant"
- Temporal: "History"